Significant liver disease: liver enzymes 2.5 folds the upper normal limit

The above is a clinical trial exclusion criterion. Annotated with entity spans:
[Qualifier: Significant] [Condition: liver disease]: [Measurement: liver enzymes] [Value: 2.5 folds the upper normal limit]